Clinical trial exclusion criterion:
hearing is better than 30 deciBel (dB) in pure tone average (500, 1000, 2000, 3-4000 Hz) and speech discrimination better than 70%

Entity relations:
- Subsumes("pure tone average", "500, 1000, 2000, 3-4000 Hz")
- Has_qualifier("hearing", "pure tone average")
- Has_value("hearing", "better than 30 deciBel (dB)")
- Has_value("speech discrimination", "better than 70%")